4. In the past one month, the clinical condition (including history, clinical symptoms and signs) was relatively stable;

The above is a clinical trial inclusion criterion. Annotated with entity spans:
4. [Temporal: In the past one month], the clinical condition (including [Temporal: history], [Condition: clinical symptoms] and signs) was [Qualifier: relatively stable];